known intracranial neoplasm, intracranial arteriovenous malformation or intracranial aneurysm

The above is a clinical trial inclusion criterion. Annotated with entity spans:
known [Condition: intracranial neoplasm], [Condition: intracranial arteriovenous malformation] or [Condition: intracranial aneurysm]